Clinical trial inclusion criterion:
3. Etiology: The insult to the central nervous system that caused the motor dysfunction must have occurred during gestation or within one year after birth independent of gestational age.

Annotated entities:
- Parsing_Error: "3."
- Non-query-able: "Etiology: The insult to the central nervous system that caused the motor dysfunction must have occurred during gestation or within one year after birth independent of gestational age."
- Temporal: "one year after birth"